Clinical trial exclusion criterion:
5. Clinically relevant laboratory abnormalities (e.g. Hgb<11g/dL, Hct<30g/dL, total cholesterol >240mg/dL, triglycerides >500mg/dL, fasting glucose >130mg/dL, liver function tests >2.5x upper limit of normal, baseline international normalized ratio >1.2)

Entity relations:
- Has_value("Hgb", "<11g/dL")
- Has_value("international normalized ratio", ">1.2")
- Has_temporal("international normalized ratio", "baseline")
- Has_value("liver function tests", ">2.5x upper limit of normal")
- Has_value("fasting glucose", ">130mg/dL")
- Has_value("triglycerides", ">500mg/dL")
- Has_value("total cholesterol", ">240mg/dL")
- Has_value("Hct", "<30g/dL")
- Has_qualifier("laboratory abnormalities", "Clinically relevant")
- Subsumes("laboratory abnormalities", "Hgb")
- OR("Hgb", "Hct", "total cholesterol", "triglycerides", "fasting glucose", "liver function tests", "international normalized ratio")